一名 62 歲患有氣喘之男性，因頭痛及頭暈至門診求診。病史詢問告知曾有痛風發作，過去有高血壓病史但未規則治療。身體檢查發現病人意識尚清晰、血壓 178/98 mmHg、心率 72/min 且規則、頸靜脈無怒張、心尖有 Gr 2/6 心收縮期雜音、肺部無囉音、手腳也無浮腫。心電圖顯示竇房律（sinus rhythm）及左心室肥厚。下列那個藥物組合最適合此病人服用？① atenolol 100 mg QD ② captopril 12.5 mg TID  ③ furosemide 20 mg QD ④ amlodipine 5 mg QD
A. ①②
B. ①③
C. ②③
D. ②④

正確答案：D. ②④